¿Cuál de las siguientes moléculas tiene el ángulo de enlace más pequeño?:
1. H2O.
2. NH3.
3. CH4.
4. SO2.
5. BF3.

Respuesta correcta: 1. H2O.